7 歲小朋友有下列眼屈光異常，何者比較會有弱視之虞？
A. 兩眼近視各兩百度（即 -2.0D）
B. 兩眼遠視各兩百度（即 +2.0D）
C. 單純近視性散光兩百度（兩眼眼球之水平軸平光，垂直軸 -2.0D）
D. 兩眼遠視不等視兩百度（例如一眼 +1.0D，另一眼 +3.0D）

正確答案：D. 兩眼遠視不等視兩百度（例如一眼 +1.0D，另一眼 +3.0D）